下列何種疾病較不易併發周邊潰瘍性角膜炎（peripheral ulcerative keratitis）？
A. 類風溼性關節炎（rheumatoid arthritis）
B. 全身性紅斑性狼瘡（systemic lupus erythematosus）
C. 韋格納肉芽腫（Wegener granulomatosis）
D. 多發性硬化症（multiple sclerosis）

正確答案：D. 多發性硬化症（multiple sclerosis）